Currently receiving any other investigational drug or having received an investigational drug within the 60 days preceding the baseline visit (Visit 2).

The above is a clinical trial exclusion criterion. Annotated with entity spans:
[Competing_trial: Currently receiving any other investigational drug or having received an investigational drug within the 60 days preceding the baseline visit (Visit 2)].